La formación de urea, necesaria para eliminar el exceso de nitrógeno producido durante la degradación de los aminoácidos:
1. Es un proceso que se lleva a cabo en el citosol de todos los tipos celulares.
2. A corto plazo está regulada mediante control alostérico de la cabarmil-fosfato sintetasa I.
3. Se inhibe en presencia de altas concentraciones de glutamato.
4. Comparte reacciones con el ciclo de las pentosas fosfato.

Respuesta correcta: 2. A corto plazo está regulada mediante control alostérico de la cabarmil-fosfato sintetasa I.